Clinical trial exclusion criterion:
Multiorgan transplants and/or previously transplanted with any other organ than kidney.

Annotated entities:
- Procedure: "Multiorgan transplants"
- Temporal: "previously"
- Procedure: "transplanted with any other organ than kidney"